(5)Known serious medical conditions, including: Cardiovascular: patients with clinically diagnosed cardiac dysfunction (NYHA class III and above), hypertrophic obstructive cardiomyopathy, clinically significant valvular heart disease, acute coronary syndrome within the last 3 months, or percutaneous coronary intervention (PCI), or coronary artery bypass graft (CABG); or abnormal pre-enrollment ECG test results with clinically significant arrhythmias (atrial flutter, atrial fibrillation, grade II-III atrioventricular block, etc.); Digestive: a previous diagnosis of various types of viral hepatitis that are still in the active phase; abnormal pre-enrollment liver function test results (ALT, AST, GGT, TBIL, or DBIL 3 times higher than normal, ALB = 30g/L); gastrectomy and/or gastrojejunostomy; gastrointestinal dysfunction; Urinary: pre-enrollment serum creatinine greater than 200umol/L; clinical diagnosis of renal artery stenosis, isolated kidney, kidney transplantation and/or other diseases; Endocrine: type 1 diabetes or uncontrolled type 2 diabetes (fasting blood glucose above 11.1 mmol/L at pre-enrollment); previous diagnosis of hyperthyroidism and failure to correct; Respiratory: pulmonary heart disease; chronic obstructive pulmonary disease; Neuropsychiatric: recent transient ischemic attack or stroke (within the last 3 months); peripheral or severe autonomic dysfunction; mental or nervous system dysfunction, inability to express desire; known drug or alcohol dependence; Malignancy, malnutrition, hematopoietic disorders and other serious diseases.

The above is a clinical trial exclusion criterion. Annotated with entity spans:
(5)Known [Qualifier: serious] [Condition: medical conditions], including: Cardiovascular: patients with [Qualifier: clinically diagnosed] [Condition: cardiac dysfunction] ([Measurement: NYHA class] [Value: III and above]), [Condition: hypertrophic obstructive cardiomyopathy], [Qualifier: clinically significant] [Condition: valvular heart disease], [Condition: acute coronary syndrome] [Temporal: within the last 3 months], or [Procedure: percutaneous coronary intervention (PCI)], or [Procedure: coronary artery bypass graft (CABG)]; or [Value: abnormal] [Temporal: pre-enrollment] [Measurement: ECG test] results with [Qualifier: clinically significant] [Condition: arrhythmias] ([Condition: atrial flutter], [Condition: atrial fibrillation], [Qualifier: grade II]-III [Condition: atrioventricular block], etc.); Digestive: a [Temporal: previous] diagnosis of various types of [Condition: viral hepatitis] that are still in the [Qualifier: active phase]; [Value: abnormal] [Temporal: pre-enrollment] [Measurement: liver function test] results ([Measurement: ALT], [Measurement: AST], [Measurement: GGT], [Measurement: TBIL], or [Measurement: DBIL] [Value: 3 times higher than normal], [Measurement: ALB] [Value: = 30g/L]); [Procedure: gastrectomy] and/or [Procedure: gastrojejunostomy]; [Condition: gastrointestinal dysfunction]; Urinary: [Temporal: pre-enrollment] [Measurement: serum creatinine] [Value: greater than 200umol/L]; [Qualifier: clinical diagnosis] of [Condition: renal artery stenosis], [Condition: isolated kidney], [Procedure: kidney transplantation] and/or other diseases; Endocrine: [Condition: type 1 diabetes] or [Qualifier: uncontrolled] [Condition: type 2 diabetes] ([Measurement: fasting blood glucose] [Value: above 11.1 mmol/L] [Temporal: at pre-enrollment]); [Temporal: previous] diagnosis of [Condition: hyperthyroidism] and [Observation: failure to correct]; Respiratory: [Condition: pulmonary heart disease]; [Condition: chronic obstructive pulmonary disease]; Neuropsychiatric: [Temporal: recent] [Condition: transient ischemic attack] or [Condition: stroke] ([Temporal: within the last 3 months]); [Qualifier: peripheral] or [Qualifier: severe] [Condition: autonomic dysfunction]; [Condition: mental] or [Condition: nervous system dysfunction], [Observation: inability to express desire]; known [Condition: drug] or [Condition: alcohol dependence]; [Condition: Malignancy], [Condition: malnutrition], [Condition: hematopoietic disorders] and other serious diseases.